Clinical trial inclusion criterion:
histologically proven prostate adenocarcinoma within 1 year of enrollment

Entity relations:
- Has_qualifier("prostate adenocarcinoma", "histologically proven")
- Has_index("within 1 year of enrollment", "enrollment")
- Has_temporal("prostate adenocarcinoma", "within 1 year of enrollment")